Patients presenting for abdominal myomectomy with documented uterine fibroids on pelvic imaging (pelvic ultrasound or MRI) within in last 12 months

The above is a clinical trial inclusion criterion. Annotated with entity spans:
Patients presenting for [Procedure: abdominal myomectomy] with documented [Condition: uterine fibroids] on [Procedure: pelvic imaging] ([Procedure: pelvic ultrasound] or [Procedure: MRI]) [Temporal: within in last 12 months]